Clinical trial exclusion criterion:
Patients incapable to understanding and will;

Annotated entities:
- Observation: "incapable to understanding"
- Observation: "will incapable to"